History of seizures within last 10 years

The above is a clinical trial exclusion criterion. Annotated with entity spans:
History of [Condition: seizures] [Temporal: within last 10 years]